Clinical trial inclusion criterion:
history of gastrectomy,

Entity relations:
- Has_temporal("gastrectomy", "history")